Less than 30 yrs of age or > 65 yrs of age

The above is a clinical trial exclusion criterion. Annotated with entity spans:
[Value: Less than 30 yrs] of [Person: age] or [Value: > 65 yrs] of [Person: age]